Clinical trial exclusion criterion:
Patients with any panel reactive antibody (PRA) equal to or above 50%, class I or class II;

Annotated entities:
- Measurement: "panel reactive antibody"
- Measurement: "PRA"
- Value: "equal to or above 50%"
- Value: "class I"
- Value: "class II"